Clinical trial exclusion criteria:
History of curettage or other intrauterine surgery
History of post-abortion complication or infection

Annotated entities:
- Procedure: "curettage"
- Temporal: "History"
- Procedure: "intrauterine surgery"
- Condition: "post-abortion complication"
- Condition: "post-abortion infection"
- Temporal: "History"